at least two symptoms of UTI (dysuria, urgency of micturition, frequency, lower abdominal pain)

The above is a clinical trial inclusion criterion. Annotated with entity spans:
[Multiplier: at least two] [Condition: symptoms of UTI] ([Condition: dysuria], [Condition: urgency of micturition], [Condition: frequency], [Condition: lower abdominal pain])